El nivel de significación (   suele ser un valor:
1. Muy pequeño porque cuanto menor es α mayor es la probabilidad de rechazar erróneamente la hipótesis nula.
2. Muy pequeño porque cuanto mayor es α mayor es la probabilidad de rechazar erróneamente la hipótesis nula.
3. Muy grande porque cuanto mayor es α mayor es la probabilidad de rechazar la hipótesis nula.
4. Muy pequeño porque cuanto mayor es α menor es la probabilidad de rechazar erróneamente la hipótesis nula.

Respuesta correcta: 2. Muy pequeño porque cuanto mayor es α mayor es la probabilidad de rechazar erróneamente la hipótesis nula.